關於大腸直腸癌之描述何者正確？
A. 大腸直腸癌治療後如有復發，多半集中在前四年，因此五年存活率極具參考價值
B. T3N0M0屬於第三期
C. T1N1M0屬於第二期
D. 肺部是大腸直腸癌最容易轉移的內臟器官

正確答案：A. 大腸直腸癌治療後如有復發，多半集中在前四年，因此五年存活率極具參考價值